Clinical trial exclusion criterion:
Patient enrolled in the study within the past 72 hours

Annotated entities:
- Observation: "enrolled in the study"
- Temporal: "within the past 72 hours"